Clinical trial exclusion criteria:
Patients who have had a prior abdominal myomectomy
Post-menopausal women
Patients with known bleeding/clotting disorders
Patients with a history of gynecologic malignancy
History of allergic reactions attributed to compounds of similar chemical or biologic composition to misoprostol
Any cases converted to abdominal hysterectomy or other additional elective surgical procedures performed at time of abdominal myomectomy will be excluded from data analysis
Uncontrolled intercurrent illness including, but not limited to, ongoing or active infection, symptomatic congestive heart failure, unstable angina pectoris, cardiac arrhythmia, or psychiatric illness/social situations that would limit compliance with study requirements.

Annotated entities:
- Temporal: "prior"
- Procedure: "abdominal myomectomy"
- Observation: "Post-menopausal"
- Person: "women"
- Condition: "clotting disorders"
- Condition: "disorders bleeding"
- Condition: "gynecologic malignancy"
- Temporal: "history"
- Temporal: "History"
- Condition: "allergic reactions"
- Drug: "compounds of similar chemical or biologic composition to misoprostol"
- Drug: "misoprostol"
- Procedure: "abdominal hysterectomy"
- Mood: "converted to"
- Qualifier: "elective"
- Procedure: "surgical procedures"
- Temporal: "at time of abdominal myomectomy"
- Reference_point: "abdominal myomectomy"
- Procedure: "abdominal myomectomy"
- Qualifier: "additional"
- Qualifier: "other"
- Qualifier: "Uncontrolled"
- Condition: "intercurrent illness"
- Qualifier: "active"
- Temporal: "ongoing"
- Condition: "infection"
- Qualifier: "symptomatic"
- Condition: "congestive heart failure"
- Condition: "unstable angina pectoris"
- Condition: "cardiac arrhythmia"
- Condition: "psychiatric illness"
- Observation: "social situations that would limit compliance with study requirements"